Clinical trial inclusion criterion:
Healthy as determined by a responsible and experienced physician, based on a medical evaluation including medical history, physical examination, laboratory tests and cardiac monitoring. A subject with a clinical abnormality or laboratory parameter(s) which is/are not specifically listed in the inclusion or exclusion criteria, outside the reference range for the population being studied may be included only if the Investigator in consultation with the GSK Medical Monitor if required agree and document that the finding is unlikely to introduce additional risk factors and will not interfere with the study procedures.

Entity relations:
- AND("Healthy", "medical evaluation")
- Has_temporal("Healthy", "medical history")
- AND("Healthy", "physical examination")
- AND("Healthy", "laboratory tests")
- AND("Healthy", "cardiac monitoring")
- Has_value("laboratory parameter", "outside the reference range")